Clinical trial exclusion criterion:
Patients with other interventions planned prior to the end of the study period (orthosis, surgery etc.).

Annotated entities:
- Non-query-able: "Patients with other interventions planned prior to the end of the study period (orthosis, surgery etc.)"